Clinical trial exclusion criterion:
The dura damage during surgery

Entity relations:
- Has_context("surgery", "dura damage")